下一列那一條韌帶在踝關節扭傷發生率最高？
A. 三角韌帶（deltoid ligament）
B. 前脛腓骨韌帶（anterior tibiofibular ligament）
C. 後距腓骨韌帶（posterior talofibular ligament）
D. 前距腓骨韌帶（anterior talofibular ligament）

正確答案：D. 前距腓骨韌帶（anterior talofibular ligament）